Clinical trial exclusion criterion:
5. Patients with recent (less than 3 years) use chemical drugs or have obvious psychological problems

Annotated entities:
- Non-query-able: "atients with recent (less than 3 years) use chemical drugs or have obvious psychological problems"